What is the function of the viral KP4 protein?

The virally encoded fungal toxin KP4  specifically blocks L-type voltage-gated calcium channels.